一位 48 歲母親，15 年前罹患卵巢子宮內膜異位症曾接受手術治療，現在她的 24 歲大女兒也有相同 疾病，她很擔心 22 歲二女兒也會有相同疾病。子宮內膜異位症可能屬於下列那一種遺傳模式？
A. autosomal recessive with variable penetrance
B. polygenetic multifactorial
C. spontaneous mutations
D. no evidence of genetic inheritance

正確答案：B. polygenetic multifactorial